weigh more than 200 lbs

The above is a clinical trial inclusion criterion. Annotated with entity spans:
[Measurement: weigh] [Value: more than 200 lbs]